Reaccionan a la presión profunda y vibración rápida los corpúsculos de:
1. Meissner.
2. Merkel.
3. Ruffini.
4. Pacini.

Respuesta correcta: 4. Pacini.